Clinical trial exclusion criteria:
type 1 diabetes,specific types of diabetes,gestational diabetes or pregestational diabetes;
acute cardiovascular or cerebrovascular accidents within past 3 months;
severe hepatic or renal dysfunction;
malignant tumor;
allergic history or contraindication for any drugs in trials;
taking part in other clinical trials;
obviously poor compliance.

Annotated entities:
- Condition: "type 1 diabetes"
- Condition: "diabetes"
- Qualifier: "specific types"
- Condition: "gestational diabetes"
- Condition: "pregestational diabetes"
- Condition: "accidents cardiovascular"
- Condition: "cerebrovascular accidents"
- Qualifier: "acute"
- Temporal: "within past 3 months"
- Condition: "renal dysfunction"
- Condition: "hepatic dysfunction"
- Qualifier: "severe"
- Condition: "malignant tumor"
- Condition: "allergic"
- Temporal: "history"
- Condition: "contraindication"
- Drug: "drugs in trials"
- Qualifier: "any"
- Competing_trial: "taking part in other clinical trials"
- Qualifier: "obviously"
- Observation: "poor compliance"